Clinical trial inclusion criterion:
no contraindications for chemotherapy

Entity relations:
- Has_negation("contraindications", "no")
- AND("contraindications", "chemotherapy")